vaginal and urinary infection

The above is a clinical trial exclusion criterion. Annotated with entity spans:
vaginal [Grammar_Error: and] [Condition: urinary infection]